Life expectancy >/= 4 months for maintenance cohorts and >/= 6 months for adjuvant cohorts

The above is a clinical trial inclusion criterion. Annotated with entity spans:
[Observation: Life expectancy] [Value: >/= 4 months] for [Context_Error: maintenance cohorts] and [Value: >/= 6 months] for [Observation: adjuvant cohorts]